下列那些疾病好發在左側？①精索靜脈曲張（varicocele） ②腹裂（gastroschisis） ③隱睪症 （undescended testis） ④ Bochdalek型先天性橫膈膜疝氣（Congential diaphragmatic hernia, Bochdalek type）
A. ①②
B. ①③
C. ②④
D. ①④

正確答案：D. ①④